Clinical trial exclusion criterion:
19. Known intolerance to study drugs.

Entity relations:
- AND("intolerance", "study drugs")